Informed consent must be obtained prior to any study procedure.

The above is a clinical trial inclusion criterion. Annotated with entity spans:
[Post-eligibility: Informed consent must be obtained prior to any study procedure].